Clinical trial exclusion criterion:
Earlier allergic reactions to glucocorticosteroid or local anesthetic.

Entity relations:
- Has_temporal("allergic reactions", "Earlier")
- Subsumes("allergic reactions", "glucocorticosteroid")
- OR("glucocorticosteroid", "local anesthetic")